Clinical trial exclusion criterion:
Evidence of sympathetic integrity below the lesion level by the skin axon-reflex vasodilatation (SkARV) test;

Entity relations:
- Has_qualifier("sympathetic integrity", "below the lesion level")
- Subsumes("test skin axon-reflex vasodilatation", "SkARV")
- Has_context("test skin axon-reflex vasodilatation", "sympathetic integrity")